uncontrolled hypertension (treated systolic blood pressure > 155 mmHg or diastolic blood pressure > 95 mmHg)

The above is a clinical trial exclusion criterion. Annotated with entity spans:
[Qualifier: uncontrolled] [Condition: hypertension] ([Qualifier: treated] [Measurement: systolic blood pressure] [Value: > 155 mmHg] or [Measurement: diastolic blood pressure] [Value: > 95 mmHg])